Clinical trial exclusion criterion:
Prior transplant with stem cell infusion 90 days or active graft-versus-host treatment within 8 weeks of Day 1.

Annotated entities:
- Procedure: "transplant"
- Procedure: "stem cell infusion"
- Temporal: "90 days of Day 1"
- Temporal: "active"
- Procedure: "graft-versus-host treatment"
- Temporal: "within 8 weeks of Day 1"
- Temporal: "Prior"